En el diagrama de fases de una sustancia pura:
1. La línea que representa las condiciones de equilibrio de equilibrio sólido-líquido tiene pendiente positiva para todas las sustancias.
2. La línea que representa las condiciones de equilibrio líquido-vapor tiene por extremos el punto triple y el punto crítico de dicha sustancia.
3. Cada sólido sublima a una temperatura fija dependiente únicamente de la naturaleza de dicho sólido.
4. La ecuación de Clausius-Clapeyron proporciona la pendiente de la presión de vapor de una sustancia en función de su volumen molar cuando la sustancia líquida está en equilibrio con su vapor.

Respuesta correcta: 2. La línea que representa las condiciones de equilibrio líquido-vapor tiene por extremos el punto triple y el punto crítico de dicha sustancia.